LVEF < 1 UNL

The above is a clinical trial exclusion criterion. Annotated with entity spans:
[Measurement: LVEF] [Value: < 1 UNL]